Clinical trial inclusion criterion:
singleton, term pregnancy

Annotated entities:
- Qualifier: "singleton"
- Qualifier: "term"
- Condition: "pregnancy"